Clinical trial exclusion criterion:
Hb level < 9gm/dl

Entity relations:
- Has_value("Hb level", "< 9gm/dl")